Clinical trial inclusion criterion:
No measurable remaining vestibular function

Entity relations:
- Has_negation("remaining vestibular function", "No")